Clinical trial inclusion criterion:
Presented for elective gastrointestinal endoscopy

Annotated entities:
- Qualifier: "elective"
- Procedure: "gastrointestinal endoscopy"